Clinical trial exclusion criterion:
Previous coronary artery bypass graft surgery within the previous 6 months

Entity relations:
- Has_temporal("coronary artery bypass graft surgery", "within the previous 6 months")
- Has_temporal("coronary artery bypass graft surgery", "Previous")